Señale cuál de las siguientes afirmaciones es correcta respecto a la depresión:
1. En la infancia existe una menor prevalencia de distimia que de depresión mayor.
2. La prevalencia de distimia en la infancia es superior en niñas que en niños.
3. La anhedonia es un síntoma poco relevante de la depresión en la infancia y adolescencia.
4. Las anomalías neuroendocrinas son uno de los factores internos más importante en la génesis de la depresión infantil.
5. La prevalencia de trastornos bipolares es menor en la infancia que en la edad adulta.

Respuesta correcta: 5. La prevalencia de trastornos bipolares es menor en la infancia que en la edad adulta.